Clinical trial exclusion criterion:
Previous enrolment in this or current enrolment in a potentially confounding tria

Annotated entities:
- Competing_trial: "Previous enrolment in this or current enrolment in a potentially confounding tria"